Clinical trial exclusion criterion:
Any suicidal behavior in the past based on the C-SSRS

Entity relations:
- Has_temporal("suicidal behavior", "in the past")
- AND("C-SSRS", "suicidal behavior")